Clinical trial exclusion criterion:
Age < 45 or > 55 years.

Annotated entities:
- Person: "Age"
- Value: "< 45 or > 55 years"